An expected survival of = 3 months;

The above is a clinical trial inclusion criterion. Annotated with entity spans:
An [Observation: expected survival] of [Value: = 3 months];